與染色體（chromosome）結合的蛋白質有 1000 多種以上，其中五種蛋白質具有很明顯的胺基酸共識序列（consensus amino acid sequence），該種蛋白質富含離胺酸（lysine）和精胺酸（arginine），是染色質（chromatin）的主要結構蛋白，請問該蛋白質為何？
A. 支架蛋白（scaffolding proteins）
B. 核仁蛋白（nucleolus proteins）
C. 組織蛋白（histone proteins）
D. 轉錄因子（transcription factors）

正確答案：C. 組織蛋白（histone proteins）